下列何者之唾液含有神經毒素，在吸食宿主血液時，會造成宿主之運動神經麻痺？
A. 體蝨（body louse）
B. 臭蟲（bedbug）
C. 舌蠅（tsetse fly）
D. 蜱（tick）

正確答案：D. 蜱（tick）